Has a history of known demyelinating diseases such as multiple sclerosis or optic neuritis

The above is a clinical trial exclusion criterion. Annotated with entity spans:
Has a [Temporal: history] of known [Condition: demyelinating diseases] such as [Condition: multiple sclerosis] or [Condition: optic neuritis]